Evidence of severe symptomatic heart failure (NYHA Class III or IV)

The above is a clinical trial exclusion criterion. Annotated with entity spans:
Evidence of [Qualifier: severe] [Qualifier: symptomatic] [Condition: heart failure] ([Measurement: NYHA] [Value: Class III or IV])